背柱中央蹄系統（dorsal column-medial lemniscal system）中訊息經由first-order neuron， second-order neuron以及third-order neuron由周邊往中樞傳遞，對於這三類neurons之細胞體的可能所在位置之敘述，下列何者正確？
A. first-order neuron位於dorsal horn of the spinal cord
B. second-order neuron位於brain stem
C. third-order neuron位於hypothalamus
D. third-order neuron位於substantial nigra

正確答案：B. second-order neuron位於brain stem